人體主要胺基酸基本結構為：
A. L-α form
B. L-β form
C. D-α form
D. D-β form

正確答案：A. L-α form